Clinical trial inclusion criterion:
Diagnosis of chronic HCV infection, defined as positive HCV antibody or HCV RNA more than 6 months prior to screening OR an assessment of fibrosis F2 or greater prior to screening.

Entity relations:
- Has_index("prior to screening", "screening")
- Has_value("assessment of fibrosis", "F2 or greater")
- Has_temporal("assessment of fibrosis", "prior to screening")
- Has_index("more than 6 months prior to screening", "screening")
- Has_temporal("HCV RNA", "more than 6 months prior to screening")
- Has_value("HCV antibody", "positive")
- Has_temporal("HCV antibody", "more than 6 months prior to screening")
- OR("HCV antibody", "HCV RNA")
- OR("HCV antibody", "assessment of fibrosis")